Quinesina y dineína son:
1. Proteínas de adhesión.
2. Motores microtubulares.
3. Enzimas degradativas.
4. Componentes de la cubierta vesicular.
5. Factores transcripcionales.

Respuesta correcta: 2. Motores microtubulares.